Clinical trial exclusion criterion:
Unavailable for followup

Annotated entities:
- Post-eligibility: "Unavailable for followup"